What is the role of ZNF335 in microcephaly?

Microcephaly gene links trithorax and REST/NRSF to control neural stem cell proliferation and differentiation. Znf335 null mice are embryonically lethal, and conditional knockout leads to severely reduced cortical size. RNA-interference and postmortem human studies show that ZNF335 is essential for neural progenitor self-renewal, neurogenesis, and neuronal differentiation.